Which SLC family is FLVCR1 a member of?

Feline leukemia virus subgroup C receptor (FLVCR1) is a member of the SLC49 family.